Clinical trial exclusion criterion:
with centre neural system involvement

Annotated entities:
- Condition: "centre neural system involvement"